History of severe, clinically significant brain or spinal cord trauma (e.g., cerebral contusion, spinal cord compression)

The above is a clinical trial exclusion criterion. Annotated with entity spans:
History of [Qualifier: severe], [Qualifier: clinically significant] [Condition: brain] or [Condition: spinal cord trauma] (e.g., [Condition: cerebral contusion], [Condition: spinal cord compression])